Clinical trial exclusion criterion:
18. Subject participated in any other clinical trial within the previous three months;

Annotated entities:
- Context_Error: "Subject participated in any other clinical trial within the previous three months;"